有關自主神經反射異常（autonomic dysreflexia，AD）的敘述，下列何者錯誤？
A. 經常發生於脊髓損傷部位高於T6～T8以上的病人
B. 病人會有低血壓
C. 病人會有頭痛及患部以上潮紅
D. 男性病人常併有尿道平滑肌共濟失調（dyssynergia）

正確答案：B. 病人會有低血壓